下列疾病或病變何者較不常見於早產兒？
A. 顱內出血（intracranial hemorrhage）
B. 壞死性小腸結腸炎（necrotizing enterocolitis）
C. 玻璃膜疾病（hyaline membrane disease）
D. 先天性德國麻疹（congenital rubella）

正確答案：D. 先天性德國麻疹（congenital rubella）